Clinical trial inclusion criterion:
ANC ≥ 1.5 x 109/L

Annotated entities:
- Measurement: "ANC"
- Value: "≥ 1.5 x 109/L"